Clinical trial inclusion criterion:
primary total knee replacement surgery

Entity relations:
- Has_qualifier("total knee replacement surgery", "primary")